Which pharmacogenetic test is available for abacavir?

The pharmacogenetic test recommended prior to abacavir administration is the HLA B*5701 genotyping.